Clinical trial exclusion criterion:
RMI contre-indication(particle or metal prosthesis, pacemaker, claustrophobia) or contrast product contre-indication (allergy)

Annotated entities:
- Procedure: "RMI"
- Condition: "RMI contre-indication"
- Undefined_semantics: "RMI contre-indication"